Clinical trial exclusion criterion:
Anatomically narrow ocular angles.

Annotated entities:
- Condition: "Anatomically narrow ocular angles"